Male or female >18 years of age at the time of screening

The above is a clinical trial inclusion criterion. Annotated with entity spans:
[Person: Male] or [Person: female] [Value: >18 years of age] [Temporal: at the time of screening]